Clinical trial exclusion criterion:
Known or suspected allergy

Entity relations:
- Has_mood("allergy", "Known")
- OR("Known", "suspected")